Limited life expectancy due to cancer or end-stage renal or liver disease

The above is a clinical trial exclusion criterion. Annotated with entity spans:
[Value: Limited] [Person: life expectancy] due to [Condition: cancer] or [Condition: end-stage renal] or [Condition: liver disease]